Clinical trial exclusion criterion:
using daily medication for chronic condition

Annotated entities:
- Multiplier: "daily"
- Drug: "medication"
- Condition: "chronic condition"